有關colon diverticular disease，下列敘述何者錯誤？
A. 一般而言，最常發生於sigmoid及descending colon，因colon lumen較窄。但在亞洲，較常發生於right colon及cecum
B. abdominal CT是診斷acute diverticulitis的標準
C. 對於Hinchey classification stageⅢ之diverticulitis with perforation，需進行手術治療
D. complicated diverticulitis最常發生fistula的器官為膀胱，且女多於男

正確答案：D. complicated diverticulitis最常發生fistula的器官為膀胱，且女多於男